Clinical trial exclusion criterion:
Preexisting medical condition (thyroid disease, diabetes mellitus, hypertension, pulmonary conditions, cardiac condition…).

Entity relations:
- OR("thyroid disease", "diabetes mellitus", "hypertension", "pulmonary conditions", "cardiac condition")